Which particular intersex phenotype is related to steroid reductase?

Hypospadias is a rare form of intersex due to reduced activity of steroid reductase 5 alpha-reductase.